下列何者造成全血球減少（pancytopenia）的機會最小？
A. systemic lupus erythematosus
B. paroxysmal nocturnal hemoglobinuria
C. vitamin B12 deficiency
D. iron deficiency

正確答案：D. iron deficiency